Clinical trial exclusion criterion:
12. Evidence of active infection requiring intravenous or oral antibiotics within 4 weeks of Screening.

Entity relations:
- Has_index("within 4 weeks of Screening", "Screening")
- Has_temporal("infection requiring antibiotics", "within 4 weeks of Screening")